Clinical trial inclusion criterion:
Symptoms of COPD: Subjects must score 2 or higher on the modified Medical Research Council Dyspnea scale (Visit 1)

Entity relations:
- Has_value("modified Medical Research Council Dyspnea scale", "score 2 or higher")
- Subsumes("Symptoms of COPD", "modified Medical Research Council Dyspnea scale")